有關成熟骨骼肌纖維和心肌纖維的比較，下列敘述何者正確？
A. 兩者都屬多核細胞
B. 兩者都藉肌間盤（intercalated disk）連結相鄰的肌細胞
C. 皆有基底板（basal lamina）包被
D. 兩者都具有絲分裂的能力

正確答案：C. 皆有基底板（basal lamina）包被